Clinical trial exclusion criterion:
FEV1 >= 80% or FEV1 < 20% of predicted value post-bronchodilator.

Annotated entities:
- Measurement: "FEV1"
- Value: ">= 80%"
- Measurement: "FEV1"
- Value: "< 20% of predicted value"
- Qualifier: "post-bronchodilator"
- Temporal: "post-bronchodilator"
- Drug: "bronchodilator"
- Reference_point: "bronchodilator"